At least 18 years of age

The above is a clinical trial inclusion criterion. Annotated with entity spans:
[Value: At least 18 years] of [Person: age]